Clinical trial exclusion criterion:
Had unprotected sexual intercourse within 30 days before study entry and who do not agree to use a highly effective method of contraception (eg, total abstinence, an intrauterine device, a double-barrier method [such as condom plus diaphragm with spermicide], a contraceptive implant, an oral contraceptive, or have a vasectomized partner with confirmed azoospermia) throughout the entire study period and for 28 days after study drug discontinuation

Annotated entities:
- Condition: "unprotected sexual intercourse"
- Temporal: "within 30 days before study entry"
- Reference_point: "study entry"
- Observation: "do not agree"
- Qualifier: "highly effective"
- Observation: "method of contraception"
- Measurement: "abstinence"
- Value: "total"
- Device: "intrauterine device"
- Observation: "double-barrier method"
- Device: "condom"
- Device: "diaphragm with spermicide"
- Device: "contraceptive implant"
- Drug: "oral contraceptive"
- Procedure: "vasectomized"
- Person: "partner"
- Condition: "azoospermia"
- Temporal: "throughout the entire study period"
- Temporal: "for 28 days after study drug discontinuation"
- Reference_point: "the entire study period"
- Reference_point: "study drug discontinuation"
- Drug: "study drug"